Clinical trial inclusion criteria:
Women subjected to ICSI through controlled ovarian hyperstimulation (COH) with pituitary downregulation by GnRH antagonist.

Annotated entities:
- Person: "Women"
- Procedure: "ICSI"
- Procedure: "ovarian hyperstimulation"
- Procedure: "COH"
- Procedure: "pituitary downregulation"
- Procedure: "GnRH antagonist"